Clinical trial exclusion criterion:
Use of any immunosuppressive drug at the time of the study or 30 days previously. Topical steroids will not be considered an immunosuppressive drug and their use will not be considered an exclusion criteria.

Entity relations:
- Has_temporal("immunosuppressive drug", "at the time of the study")
- Has_negation("Topical steroids", "not")
- AND("immunosuppressive drug", "Topical steroids")
- OR("at the time of the study", "30 days previously")